Acute illness or active systemic infection or sepsis

The above is a clinical trial exclusion criterion. Annotated with entity spans:
[Condition: Acute illness] or [Qualifier: active] [Condition: systemic infection] or [Condition: sepsis]